Clinical trial exclusion criterion:
Patient planned for or has had a revascularization procedure in the affected leg within the last 8 weeks

Entity relations:
- Has_temporal("revascularization procedure", "within the last 8 weeks")
- Has_index("revascularization procedure", "affected leg")
- Has_mood("revascularization procedure", "planned")
- OR("planned", "has had")